En la exploración funcional de un paciente con enfermedad pulmonar obstructiva crónica, son esperables todos los hallazgos MENOS uno:
1. FEV1 menor del 80%.
2. DLCO disminuida.
3. Cociente FEV1/FVC inferior al 0.7.
4. Volúmenes pulmonares disminuidos.
5. Prueba broncodilatadora negativa.

Respuesta correcta: 4. Volúmenes pulmonares disminuidos.